A male or female aged 61 years or above at the time of the first vaccination.

The above is a clinical trial inclusion criterion. Annotated with entity spans:
A [Person: male] or [Person: female] [Person: aged] [Value: 61 years or above] at the time of the first vaccination.